Clinical trial inclusion criterion:
Healthy, women ages 18 to 39yo with BMI <30

Annotated entities:
- Condition: "Healthy"
- Person: "women"
- Person: "ages"
- Value: "18 to 39yo"
- Measurement: "BMI"
- Value: "<30"